下列何種利尿劑雖然具有強利尿效果，但易引起耳聾的副作用？
A. Chlorothiazide
B. Acetazolamide
C. Furosemide
D. Indapamide

正確答案：C. Furosemide